Los tics pueden asociarse a conductas alteradas que surgen en un momento determinado. Cuando los síntomas aparecen entre los 35 y los 45 años, según la clasificación de Shapiro, ¿a qué tic nos referimos?
1. Tic agudo simple.
2. Tic crónico simple.
3. Corea de Huntington.
4. Tic múltiple crónico.
5. Tic múltiple del adulto.

Respuesta correcta: 3. Corea de Huntington.